Age of = 18 years of age and able to give written informed consent;

The above is a clinical trial inclusion criterion. Annotated with entity spans:
[Person: Age] of [Value: = 18 years] of age and [Observation: able to give written informed consent];